Clinical trial exclusion criterion:
Previous adverse reaction to any of the antimalarial drugs used in this study.

Annotated entities:
- Condition: "adverse reaction"
- Temporal: "Previous"
- Drug: "antimalarial drugs"
- Qualifier: "used in this study"